Developmental delay, intellectual deficit, and/or severe educational disability resulting in some dependence for activities of daily living

The above is a clinical trial exclusion criterion. Annotated with entity spans:
[Condition: Developmental delay], [Condition: intellectual deficit], and/or s[Condition: evere educational disability] resulting in some [Condition: dependence for activities of daily living]